一位 63 歲的男性肺癌病人以口服短效型嗎啡 10 mg q4h 作為止痛治療藥物，但止痛效果仍不甚理想。 關於癌症病人嗎啡劑量的調整原則，下列何者錯誤？
A. 所謂適當的嗎啡劑量是指可緩解癌症病人疼痛的劑量，但又沒有產生無法處置的副作用，因此並無最高劑量的設定
B. 此病人突發疼痛時的口服嗎啡劑量為 24 小時基本劑量的 1/12
C. 突發疼痛時口服嗎啡使用的時間間隔為 60 至 90 分鐘
D. 如果此病人突發疼痛之嗎啡使用越來越頻繁時，應增加其按時給藥的基本劑量

正確答案：B. 此病人突發疼痛時的口服嗎啡劑量為 24 小時基本劑量的 1/12